Clinical trial exclusion criterion:
History of corneal ulcers or fungal infections

Entity relations:
- Has_temporal("fungal infections", "History")
- Has_temporal("corneal ulcers", "History")